ED physicians who work casually (less than 0.25 Full Time Equivalent)

The above is a clinical trial exclusion criterion. Annotated with entity spans:
[Non-query-able: ED physicians who work casually (less than 0.25 Full Time Equivalent)]